Clinical trial exclusion criterion:
Pregnant woman.

Annotated entities:
- Pregnancy_considerations: "Pregnant woman"